The existence of intra-cardiac thrombus on trans-esophageal echocardiography

The above is a clinical trial exclusion criterion. Annotated with entity spans:
The existence of [Condition: intra-cardiac thrombus] on [Procedure: trans-esophageal echocardiography]